Clinical trial inclusion criterion:
Moderate to advanced generalized chronic periodontitis

Entity relations:
- Has_qualifier("generalized chronic periodontitis", "Moderate to advanced")